Clinical trial inclusion criterion:
1. Must have given written informed consent (signed and dated) and any authorizations required by local law

Annotated entities:
- Parsing_Error: "1."
- Post-eligibility: "Must have given written informed consent (signed and dated) and any authorizations required by local law"